Clinical trial inclusion criterion:
nondiabetic as defined by fasting plasma glucose <126 mg/dL

Entity relations:
- Has_value("fasting plasma glucose", "<126 mg/dL")